Clinical trial exclusion criterion:
2. Recipients of previous non-renal solid organ and/or islet cell transplantation.

Annotated entities:
- Procedure: "non-renal solid organ transplantation"
- Procedure: "islet cell transplantation"
- Temporal: "previous"